La azidotimidina (AZT) que se utiliza frente al virus de la inmunodeficiencia humana:
1. Se une a la ARN polimerasa celular y bloquea la transcripción.
2. Se une al promotor temprano del virus e impide su reconocimiento por la ARN polimerasa.
3. Antagoniza la fosforilación de los nucleósidos, inhibiendo así la síntesis de ADN viral.
4. Bloquea el transporte de timidina al interior celular.
5. Inhibe la transcriptasa.

Respuesta correcta: 5. Inhibe la transcriptasa.